Clinical trial exclusion criterion:
Weight less than 40.0 kg.

Annotated entities:
- Measurement: "Weight"
- Value: "less than 40.0 kg"